Any antibiotic intake 7 days prior to blood collection.

The above is a clinical trial exclusion criterion. Annotated with entity spans:
Any [Drug: antibiotic] intake [Temporal: 7 days prior to blood collection].